一位 70 歲長時期臥床的老人，從昨天開始持續排出大量血便，來急診處時血壓 80/40 mmHg，心跳 次/min，意識不太清楚，經過急救後，生命跡象漸趨正常，下一步應作何處置？
A. 血管攝影
B. 直腸鏡
C. 肛門鏡
D. 插鼻胃管

正確答案：D. 插鼻胃管